Clinical trial exclusion criterion:
5. New York Heart Association (NYHA) Class II or higher congestive heart failure.

Annotated entities:
- Parsing_Error: "5."
- Measurement: "New York Heart Association (NYHA)"
- Value: "Class II or higher"
- Condition: "congestive heart failure"